Be able to give informed consent and comply with study guidelines

The above is a clinical trial inclusion criterion. Annotated with entity spans:
[Informed_consent: Be able to give informed consent and comply with study guidelines]